Varón de 63 años, en tratamiento desde hace 3 años con un antidepresivo. Acude a urgencias por presentar una crisis hipertensiva intensa, con taquicardia y cefalea. El paciente informa que el día anterior estaba viendo el partido de futbol en un bar, y que ha tomado un bocadillo de queso y salchichas, y más 3 copas de cervezas. ¿Qué antidepresivo podría ser?
1. Tranilcipromina.
2. Fluoxetina.
3. Venlafaxina.
4. Imipramina.
5. Duloxetina.

Respuesta correcta: 1. Tranilcipromina.